Clinical trial inclusion criteria:
Children 6 month to 14 years who will be presented to the pediatric emergency or attended by emergency medical service who have active seizure and had no intravenous access would be eligible for the study.

Annotated entities:
- Person: "Children"
- Value: "6 month to 14 years"
- Person: "years"
- Visit: "pediatric emergency"
- Observation: "attended by emergency medical service"
- Qualifier: "active"
- Condition: "seizure"
- Negation: "no"
- Device: "intravenous access"